treated with chemotherapy and/or immunosuppressive therapy

The above is a clinical trial inclusion criterion. Annotated with entity spans:
treated with [Procedure: chemotherapy] and/or [Procedure: immunosuppressive therapy]